Clinical trial exclusion criterion:
Currently undertaking other treatment that may affect the safety and/or efficacy evaluation, e.g. beta receptors agonists, et cetera.

Annotated entities:
- Non-query-able: "Currently undertaking other treatment that may affect the safety and/or efficacy evaluation"
- Drug: "beta receptors agonists"